一位患有紅斑性狼瘡的孕婦，在懷孕 29 週時主訴最近兩天有規則腹痛和胎動減少及胎心率呈現晚期減速（late deceleration）的情形發生。最可能的臆斷是：
A. 早產合併胎兒可能缺氧
B. 妊娠糖尿病
C. 前置胎盤
D. 胎死腹中

正確答案：A. 早產合併胎兒可能缺氧